Clinical trial exclusion criterion:
serotonin norepinephrine reuptake inhibitors

Annotated entities:
- Drug: "serotonin norepinephrine reuptake inhibitors"